Clinical trial inclusion criterion:
Residual alveolar width = 4 mm (Milinkovic and Cordaro, 2014), residual alveolar height >8 mm, enough inter-arch space for a crown (at least 5 mm) and a minimum distance of 7 mm from the adjacent teeth (Shah and Lum, 2008). The width and height will be confirmed after x-ray examination in Visit 2.

Entity relations:
- Has_value("Residual alveolar width", "= 4 mm")
- Has_value("residual alveolar height", ">8 mm")